Antiviral experienced,

The above is a clinical trial inclusion criterion. Annotated with entity spans:
[Drug: Antiviral] [Mood: experienced],